Women who are pregnant or who are planning to be pregnant, or who are lactating (though the possibility in our target population should be very low)

The above is a clinical trial exclusion criterion. Annotated with entity spans:
[Pregnancy_considerations: Women who are pregnant or who are planning to be pregnant, or who are lactating (though the possibility in our target population should be very low)]